Clinical trial inclusion criterion:
Oligomenorrhea/amenorrhea or polycystic syndrome (defined according to the Rotterdam criteria 2004)

Annotated entities:
- Condition: "amenorrhea"
- Condition: "Oligomenorrhea"
- Condition: "polycystic syndrome"
- Qualifier: "Rotterdam criteria 2004"